Clinical trial inclusion criterion:
No measurable remaining vestibular function

Annotated entities:
- Negation: "No"
- Measurement: "remaining vestibular function"